Clinical trial exclusion criterion:
St.p. surgery with opening the uterine cavity (incl. caesarean section)

Entity relations:
- AND("St.p.", "surgery with opening the uterine cavity")
- Subsumes("surgery with opening the uterine cavity", "caesarean section")